45y or older

The above is a clinical trial inclusion criterion. Annotated with entity spans:
[Value: 45][Person: y] or older